La ceftazidima es un antibiótico de elección en el tratamiento de las infecciones por:
1. Mycoplasma pneumoniae.
2. Pseudomonas aeruginosa.
3. Staphylococcus aureus meticilín-resistente (SAMR).
4. Chlamydia trachomatis.
5. Mycobacterium tuberculosis.

Respuesta correcta: 2. Pseudomonas aeruginosa.